The subject agrees to comply with study protocol requirements and all follow up visit requirements.

The above is a clinical trial inclusion criterion. Annotated with entity spans:
[Informed_consent: The subject agrees to comply with study protocol requirements and all follow up visit requirements].